Clinical trial exclusion criterion:
Legally incompetent or mentally impaired (e.g., minors, Alzheimer's subjects, dementia, etc.)

Entity relations:
- Subsumes("Legally incompetent", "minors")
- OR("minors", "dementia", "Alzheimer's")
- OR("Legally incompetent", "mentally impaired")